Presents to the Emergency Department (ED) and meets the clinical definition for Acute Bacterial Skin and Skin Structure Infections (ABSSSI)

The above is a clinical trial inclusion criterion. Annotated with entity spans:
Presents to the [Visit: Emergency Department (ED)] and meets the clinical definition for [Measurement: Acute Bacterial Skin and Skin Structure Infections] ([Measurement: ABSSSI])